Clinical trial inclusion criterion:
ST-segment elevation acute myocardial infarction patients during the first 12 hours of sympton onset;

Annotated entities:
- Qualifier: "ST-segment elevation"
- Condition: "acute myocardial infarction"
- Temporal: "during the first 12 hours of sympton onset"